Clinical trial inclusion criterion:
Nodal involvement

Annotated entities:
- Condition: "Nodal involvement"